下列何段空氣通道變窄是肺氣腫（emphysema）之特徵？
A. 氣管（trachea）
B. 支氣管（bronchus）
C. 細支氣管（bronchioles）
D. 肺泡囊（alveolar sac）

正確答案：C. 細支氣管（bronchioles）